Subject is immunologically suppressed, received steroids >1 month over the past year.

The above is a clinical trial exclusion criterion. Annotated with entity spans:
Subject is [Condition: immunologically suppressed], received [Drug: steroids] [Multiplier: >1 month] [Temporal: over the past year].